allergy/contra-indication for any drug used in the study

The above is a clinical trial exclusion criterion. Annotated with entity spans:
[Condition: allergy]/[Condition: contra-indication] for any [Drug: drug used in the study]